Facilities routinely using decolonization

The above is a clinical trial exclusion criterion. Annotated with entity spans:
Facilities [Multiplier: routinely] using [Procedure: decolonization]